What antibiotic is currently used as the standard of care for Clostridium Difficile infection as of 2018

Fidaxomicin has recently been introduced as a new antibiotic that has been shown to significantly reduce the recurrence of this infection. Fidaxomicin is a new antibiotic used to treat Clostridium difficile infection (CDI).